Clinical trial inclusion criterion:
males and females greater than or equal to 18 years of age

Annotated entities:
- Person: "males"
- Person: "females"
- Person: "age"
- Value: "greater than or equal to 18 years"